Clinical trial inclusion criteria:
Subjects with a history of moderate to severe psoriatic disease
Group 2: Healthy subjects without known psoriatic disease or cardiovascular disease

Annotated entities:
- Qualifier: "moderate"
- Qualifier: "severe"
- Condition: "psoriatic disease"
- Temporal: "history"
- Condition: "Healthy"
- Condition: "psoriatic disease"
- Condition: "cardiovascular disease"
- Negation: "without"